Clinical trial exclusion criterion:
8. Patients with active systemic infections

Annotated entities:
- Parsing_Error: "8."
- Condition: "systemic infections"
- Temporal: "active"